Clinical trial exclusion criteria:
Gallbladder's wall >3mm, atrophied gallbladder,gallstone obstruct the Hartmann's pouch.
Abdominal ultrasound display the contractibility of gallbladder is poor.
The aged patients with bad heart and lung function.
Patients who has acute cholecystitis,pancreatitis,pancreaticobiliary diseases, especially choledocholithiasis.
Pregnant or lactational women.

Annotated entities:
- Measurement: "Gallbladder's wall"
- Value: ">3mm"
- Condition: "atrophied gallbladder"
- Condition: "gallstone obstruct"
- Qualifier: "Hartmann's pouch"
- Procedure: "Abdominal ultrasound"
- Measurement: "contractibility of gallbladder"
- Value: "poor"
- Person: "aged"
- Condition: "bad heart function"
- Condition: "bad lung function"
- Condition: "acute cholecystitis"
- Condition: "pancreatitis"
- Condition: "pancreaticobiliary diseases"
- Condition: "choledocholithiasis"
- Condition: "Pregnant"
- Condition: "lactational"
- Person: "women"